Pregnancy and breast feeding mother;

The above is a clinical trial exclusion criterion. Annotated with entity spans:
[Condition: Pregnancy] and [Observation: breast feeding] mother;